Patients are diagnosed with T2DM for at least the last 6 months.

The above is a clinical trial inclusion criterion. Annotated with entity spans:
Patients are diagnosed with [Condition: T2DM] [Temporal: for at least the last 6 months].